16 歲女孩因矮小、心雜音及無月經而就醫。其染色體檢查為 45XO。下列何者為其最可能的心臟問題？
A. 心房中隔缺損（ASD）
B. 心室中隔缺損（VSD）
C. 開放性動脈導管（PDA）
D. 主動脈弓狹窄（coarctation of aorta）

正確答案：D. 主動脈弓狹窄（coarctation of aorta）